Clinical trial exclusion criterion:
Severe hypotension [resting SBP less than (<) 90mmHg, or resting DBP<50mmHg].

Entity relations:
- Has_value("DBP", "<50mmHg")
- Has_qualifier("DBP", "resting")
- Has_value("SBP", "less than 90mmHg")
- Has_qualifier("SBP", "resting")
- Has_qualifier("hypotension", "Severe")
- AND("hypotension", "SBP")
- OR("SBP", "DBP")